Clinical trial exclusion criterion:
Current use of serotonergic drugs (triptans, certain tricyclic antidepressants, lithium, tramadol, St. John's Wort)

Entity relations:
- Subsumes("serotonergic drugs", "triptans")
- OR("triptans", "tramadol", "lithium", "tricyclic antidepressant", "St. John's Wort")